¿Cuál es el tiempo promedio de duración de la vida de un eritrocito:
1. Cuatro meses.
2. Cuatro semanas.
3. Un año.
4. Sesenta días.
5. Dos semanas.

Respuesta correcta: 1. Cuatro meses.